La afasia receptiva o de Wernicke se caracteriza por:
1. La incapacidad de comprensión del lenguaje oral.
2. La incapacidad de comunicación de forma espontánea mediante el lenguaje hablado.
3. La incapacidad de comunicación de forma espontánea mediante el lenguaje.
4. La consciencia de los déficit del lenguaje por parte del paciente.

Respuesta correcta: 1. La incapacidad de comprensión del lenguaje oral.